有關高齡病人急性闌尾炎（acute appendicitis）之敘述，下列何者錯誤？
A. 發生急性闌尾炎之機率，較年輕人高
B. 較年輕族群症狀表現較不典型，診斷容易延遲
C. 較年輕族群，穿孔（perforation）機率大，合併症較多
D. 與盲腸憩室炎（cecal diverticulitis）鑑別診斷不易

正確答案：A. 發生急性闌尾炎之機率，較年輕人高